Clinical trial inclusion criterion:
If female, may participate if she is not pregnant, not breastfeeding, and at least one of the following: 1) Not a woman of childbearing potential (WOCBP); or 2) A WOCBP who agrees to follow the study contraceptive guidance during the treatment period and for at least 7 days after the last dose of study treatment.

Annotated entities:
- Person: "female"
- Negation: "not"
- Condition: "pregnant"
- Negation: "not"
- Observation: "breastfeeding"
- Multiplier: "at least one"
- Condition: "woman of childbearing potential (WOCBP)"
- Negation: "Not"
- Condition: "WOCBP"
- Procedure: "contraceptive guidance"
- Temporal: "during the treatment period"
- Temporal: "for at least 7 days after the last dose of study treatment"
- Reference_point: "the last dose of study treatment"
- Reference_point: "the treatment period"